Clinical trial exclusion criterion:
Fasting blood glucose >126 mg/dL at screening. Heterozygous subjects will be excluded for a fasting blood glucose >140 mg/dL.

Annotated entities:
- Measurement: "Fasting blood glucose"
- Value: ">126 mg/dL"
- Temporal: "at screening"
- Condition: "Heterozygous"
- Measurement: "fasting blood glucose"
- Value: ">140 mg/dL"
- Context_Error: "Heterozygous"